Clinical trial inclusion criterion:
Intra-Ocular Pressure (IOP) is under control (i.e., IOP ≤ 25 mm in the study eye) and study eye is not receiving any IOP lowering drops.

Annotated entities:
- Measurement: "Intra-Ocular Pressure (IOP)"
- Value: "under control"
- Measurement: "IOP"
- Value: "≤ 25 mm"
- Qualifier: "in the study eye"
- Drug: "IOP lowering drops"
- Negation: "not"
- Qualifier: "study eye"